所謂卵巢癌適當減積手術（optimal debulking），是指殘餘的腫瘤大小為：
A. < 4 cm
B. < 3.5 cm
C. < 3 cm
D. < 1.5 cm

正確答案：D. < 1.5 cm